有關鴉片類藥物戒斷症狀之敘述，下列何者正確？
A. 越短效之鴉片類藥物，越不會導致戒斷症狀
B. 無嚴重生理疾病者，很少死於戒斷症狀
C. 戒斷症狀主要有嗜睡以及心搏加速
D. 鴉片類拮抗劑（opioid antagonist，如naloxone）不會造成戒斷症狀

正確答案：B. 無嚴重生理疾病者，很少死於戒斷症狀